Active infection in the anal fistula

The above is a clinical trial exclusion criterion. Annotated with entity spans:
Active [Condition: infection in the anal fistula]